Clinical trial exclusion criterion:
Unable to take oral medications.

Annotated entities:
- Observation: "Unable to take oral medications"